Clinical trial exclusion criterion:
2. AST or ALT > 3 × ULN

Annotated entities:
- Parsing_Error: "2."
- Measurement: "AST"
- Measurement: "ALT"
- Value: "> 3 × ULN"